Clinical trial exclusion criterion:
Potential contraindications to regadenoson use due to:

Annotated entities:
- Non-representable: "Potential contraindications to regadenoson use due to:"